Una finalidad de las escalas de medición de los resultados de la clasificación NOC es:
1. Determinar el estado del paciente y evidenciar la puntuación del resultado.
2. Realizar un juicio clínico sobre la situación del paciente.
3. Determinar el grado de consecución de los objetivos planteados en el plan de cuidados.
4. Comprobar si se ha solucionado el problema identificado o es necesario formular un nuevo diagnóstico.
5. Comprobar la evolución del paciente y sustituir la fase de evaluación del proceso de cuidados.

Respuesta correcta: 1. Determinar el estado del paciente y evidenciar la puntuación del resultado.